Clinical trial exclusion criterion:
Participation in a HA support group or other activity such as meditation or yoga intended to mitigate HA or other chronic pain must be stable at least 4 weeks prior to beginning the initial screen (P1) visit and may not be started during the study

Annotated entities:
- Procedure: "Participation in a HA support group"
- Procedure: "meditation"
- Procedure: "yoga"
- Non-representable: "Participation in a HA support group or other activity such as meditation or yoga intended to mitigate HA or other chronic pain must be stable at least 4 weeks prior to beginning the initial screen (P1) visit and may not be started during the study"